¿En cuál de las siguientes patologías se produce una multineuropatía?:
1. Diabetes mellitus.
2. Vasculitis de los vasa nervorum.
3. Esclerosis múltiple.
4. Síndrome del túnel carpiano.

Respuesta correcta: 2. Vasculitis de los vasa nervorum.